Major fetal defects

The above is a clinical trial exclusion criterion. Annotated with entity spans:
[Condition: Major fetal defects]